La Teoría Triárquica de la Inteligencia formulada por R.J. Sternberg engloba la subteoría componencial, que se refiere a:
1. Formas de resolución lógica en actividades que requieren abstracción.
2. Habilidades comprometidas con la capacidad creativa.
3. Habilidades vinculadas al manejo de la vida cotidiana.
4. Actividades vinculadas a la capacidad de adaptación emocional.

Respuesta correcta: 1. Formas de resolución lógica en actividades que requieren abstracción.